Subjects with autoimmune diseases.

The above is a clinical trial exclusion criterion. Annotated with entity spans:
Subjects with [Condition: autoimmune diseases].